Clinical trial exclusion criterion:
Severe critical limb ischemia (Rutherford category 6)

Entity relations:
- Has_value("Rutherford category", "6")
- Has_qualifier("limb ischemia", "Severe")
- Subsumes("Severe", "Rutherford category")
- Has_qualifier("limb ischemia", "critical")
- Subsumes("critical", "Rutherford category")